Which organizations approved Tagsedi in 2018?

In 2018 Tagsedi was approved by the United States Food and Drug Agency, Health Canada, and European Commission.